Clinical trial exclusion criterion:
Allergy or hypersensitivity to bupivacaine

Entity relations:
- AND("Allergy", "bupivacaine")
- OR("Allergy", "hypersensitivity")